Clinical trial exclusion criterion:
patients with coagulopathy;

Annotated entities:
- Condition: "coagulopathy"